¿Podría usarse un electrodo de vidrio como electrodo de referencia?:
1. Sí, si el electrodo de vidrio es un electrodo combinado.
2. Sí, si se utiliza como electrodo indicador un electrodo de mercurio.
3. No, ya que el electrodo de vidrio es un electrodo selectivo.
4. No, porque su fundamento no es nerstiano.
5. Si, si la determinación se realiza en un medio tamponado.

Respuesta correcta: 5. Si, si la determinación se realiza en un medio tamponado.